Clinical trial exclusion criterion:
Other skin diseases that might interfere with the efficacy evaluation;

Annotated entities:
- Condition: "skin diseases"
- Qualifier: "interfere with the efficacy evaluation"